下列何種先天性代謝疾病會產生乳酸性酸中毒（lactic acidosis）？ ① galactosemia  ② pyruvate dehydrogenase deficiency  ③ Leigh's encephalopathy  ④ organic acidurias
A. ①②③
B. ①②④
C. ②③④
D. ①②③④

正確答案：C. ②③④